Clinical trial inclusion criterion:
The results of patients' blood tests are as follows:

Annotated entities:
- Non-query-able: "The results of patients' blood tests are as follows:"